關於肺癌診斷及分期，下列何者正確？
A. 正子電腦斷層造影（PET-CT）之偽陽性低，如果發現對側淋巴腺有顯影，就表示N3，病人不宜手術切除腫瘤
B. 肺臟核磁共振（MRI of lung）是肺癌的首選影像檢查
C. 在急診胸部X光片中，發現右側胸腔全白，應馬上安排胸部電腦斷層
D. 肺癌期別檢	（staging workup）時，若病人有莫名疼痛或alkaline phosphatase（ALP）不明原因升高，可以安排全身骨骼掃描（whole body bone scan）檢查

正確答案：D. 肺癌期別檢	（staging workup）時，若病人有莫名疼痛或alkaline phosphatase（ALP）不明原因升高，可以安排全身骨骼掃描（whole body bone scan）檢查